¿Cuál es el término más utilizado para designar el grado más intenso de distraibilidad y la ausencia completa de atención?
1. Perplejidad atencional.
2. Indiferencia atencional.
3. Hiperprosexia.
4. Ausencia mental.
5. Aprosexia.

Respuesta correcta: 5. Aprosexia.